Clinical trial exclusion criterion:
Documented allergy to oxycodone, morphine sulfate or acetaminophen

Annotated entities:
- Drug: "oxycodone"
- Drug: "morphine sulfate"
- Drug: "acetaminophen"
- Condition: "allergy"